Aged over 18

The above is a clinical trial inclusion criterion. Annotated with entity spans:
[Person: Aged] [Value: over 18]